La interacción entre el ciclo de la urea y ciclo del ácido cítrico se realiza a nivel de:
1. Ácido úrico.
2. Succinato.
3. Amoníaco.
4. Urea.
5. Fumarato.

Respuesta correcta: 5. Fumarato.